傳統補體路徑（classical complement pathways）早期之補體如C1，C2，C4缺乏時，會產生下列何種現象？
A. 影響到mannose-binding lectin之缺乏，易有兒童時期之感染
B. 無法清除immune complex，而有immune complex disease
C. 易有pyogenic bacteria之感染
D. 易有Pneumocystis jirovecii（先前稱Pneumocystis carinii）感染

正確答案：B. 無法清除immune complex，而有immune complex disease